Clinical trial exclusion criterion:
tinnitus or hearing loss with same debut as vertigo

Entity relations:
- OR("tinnitus", "hearing loss")